下列有關 Substernal goiter 之敘述，何者為誤？
A. 多為良性腫瘤
B. 大多發生在六、七十歲的男性
C. 多為 euthyroid state
D. 多為 cervical goiter with substernal extension，所以手術切除只須 cervical approach

正確答案：B. 大多發生在六、七十歲的男性